Clinical trial exclusion criterion:
Clinically significant new illness within 1 month before randomization that may affect the participant's ability to fulfill the study requirements or significantly confound the assessments

Annotated entities:
- Qualifier: "Clinically significant"
- Qualifier: "new"
- Condition: "illness"
- Temporal: "within 1 month before randomization"
- Reference_point: "randomization"
- Observation: "may affect the participant's ability to fulfill the study requirements"
- Observation: "significantly confound the assessments may"